Clinical trial inclusion criterion:
Partial hepatectomy

Annotated entities:
- Procedure: "Partial hepatectomy"